一位 70 歲老先生，平常有抽菸的習慣，有經常性的咳嗽，直到日前咳嗽加劇且痰液變黃，並伴隨高燒、寒顫、腹瀉、全身痠痛疲倦等症狀。一開始到一般診所就診，初步診斷為急性支氣管炎，服藥後病情不但沒改善，反而加重變成了神智不清；後來轉送到大醫院住院。經檢查後，醫師告知是為嗜肺性退伍軍人菌（Legionella pneumophila）感染之「退伍軍人症」。下列相關敘述，何者錯誤？
A. 該致病菌是一種好氧的革蘭氏陰性桿菌
B. 水是該致病菌的天然生長處
C. 院內感染來源可能來自於空調系統的冷卻水塔
D. 該菌主要藉人與人之間互相傳染

正確答案：D. 該菌主要藉人與人之間互相傳染